下列成年病患的骨折中，最常用石膏包紮作為確切治療的是：
A. 橈骨遠端骨折（Colles 氏骨折）
B. 前臂橈骨和尺骨骨折
C. 肱骨頭部粉碎性骨折
D. 鷹嘴突骨折

正確答案：A. 橈骨遠端骨折（Colles 氏骨折）